Clinical trial inclusion criterion:
11. MRI finding healthy volunteers don't have sacral perineurial cysts, included in the negative control groupblank control group

Annotated entities:
- Post-eligibility: "MRI finding healthy volunteers don't have sacral perineurial cysts, included in the negative control groupblank control group"